13. Any condition(s) that, in the opinion of the investigator, might interfere with adherence to study requirements or evaluation of the study objectives

The above is a clinical trial exclusion criterion. Annotated with entity spans:
13. [Post-eligibility: Any condition(s) that, in the opinion of the investigator, might interfere with adherence to study requirements or evaluation of the study objectives]